any history of malnutrition before enrollment

The above is a clinical trial exclusion criterion. Annotated with entity spans:
any history of [Condition: malnutrition] [Temporal: before enrollment]